Clinical trial inclusion criterion:
(2)A diagnosis or previous diagnosis of essential hypertension, including anyone currently taking antihypertensive drugs; or for those who have not taken antihypertensive drugs within the last 2 weeks, two consecutive examinations were conducted at least one day apart, and both sitting blood pressure (mean value of 3 measurements) met the following criteria: diastolic blood pressure (DBP) =90 mmHg or systolic blood pressure (SBP) =140 mmHg (the second blood pressure was measured at V1);

Entity relations:
- Has_mood("essential hypertension", "diagnosis")
- Has_negation("antihypertensive drugs", "not")
- Has_temporal("antihypertensive drugs", "within the last 2 weeks")
- Has_value("diastolic blood pressure (DBP)", "=90 mmHg")
- Has_value("systolic blood pressure (SBP)", "=140 mmHg")
- AND("sitting blood pressure", "diastolic blood pressure (DBP)")
- Has_multiplier("sitting blood pressure", "two consecutive at least one day apart")
- Has_temporal("antihypertensive drugs", "currently")
- Subsumes("essential hypertension", "antihypertensive drugs")
- AND("antihypertensive drugs", "sitting blood pressure")
- OR("diagnosis", "previous")
- OR("diastolic blood pressure (DBP)", "systolic blood pressure (SBP)")
- OR("essential hypertension", "antihypertensive drugs")